Clinical trial inclusion criterion:
birthweight greater than 2.4 kg

Entity relations:
- Has_value("birthweight", "greater than 2.4 kg")